Clinical trial inclusion criterion:
At least 8 micturitions per 24 hours and

Entity relations:
- Has_multiplier("micturitions", "At least 8 per 24 hours")